Registration with a GDP

The above is a clinical trial inclusion criterion. Annotated with entity spans:
[Non-query-able: Registration with a GDP]